El virus de la hepatitis C se ha descrito como uno de los factores implicados en la etiopatogenia de los siguientes procesos, EXCEPTO en uno:
1. Crioglobulinemia mixta.
2. Porfiria cutánea tarda.
3. Liquen plano.
4. Psoriasis pustulosa generalizada de von Zumbuch.

Respuesta correcta: 4. Psoriasis pustulosa generalizada de von Zumbuch.